La agorafobia es un trastorno de ansiedad que consiste en:
1. Una crisis de ansiedad o ataques de pánico que ocurren, por lo general, de una forma inesperada.
2. Un miedo intenso y persistente a realizar actuaciones en público.
3. La presencia de obsesiones o compulsiones de carácter recurrente que provocan grandes pérdidas de tiempo.
4. Un trastorno mental agudo con escasa carga socioeconómica y sanitaria.
5. El miedo y evitación de lugares muy concurridos o situaciones de las que resulta difícil escapar.

Respuesta correcta: 5. El miedo y evitación de lugares muy concurridos o situaciones de las que resulta difícil escapar.